Allergy or intolerance to aspirin or clopidogrel.

The above is a clinical trial exclusion criterion. Annotated with entity spans:
[Condition: Allergy] or [Condition: intolerance] to [Drug: aspirin] or [Drug: clopidogrel].